Clinical trial inclusion criterion:
Adult patient being referred for clinically indicated positron emission tomography myocardial perfusion imaging at the Centre hospitalier de l'Université de Montréal

Annotated entities:
- Person: "Adult"
- Qualifier: "clinically indicated"
- Procedure: "positron emission tomography myocardial perfusion imaging"
- Visit: "Centre hospitalier de l'Université de Montréal"